(5) For women of childbearing age, the following methods or methods of contraception use the effective method of contraception to be used during the period of this clinical trial:

The above is a clinical trial exclusion criterion. Annotated with entity spans:
[Pregnancy_considerations: (5) For women of childbearing age, the following methods or methods of contraception use the effective method of contraception to be used during the period of this clinical trial:]